Clinical trial inclusion criterion:
Stone free after definitive surgical therapy defined as fragments less than 3mm.

Annotated entities:
- Condition: "Stone"
- Negation: "free"
- Temporal: "after definitive surgical therapy"
- Reference_point: "definitive surgical therapy"
- Procedure: "definitive surgical therapy"
- Qualifier: "fragments less than 3mm"